下列何者為發生於兒童時期的先天性且進行性的病變？
A. 腦性麻痺（cerebral palsy）
B. 智能障礙（mental retardation）
C. 臂神經叢傷害（brachial plexus injury）
D. 裘馨氏肌肉萎縮症（Duchenne muscular dystrophy）

正確答案：D. 裘馨氏肌肉萎縮症（Duchenne muscular dystrophy）